藍斑核（locus coeruleus）神經元釋放下列何種神經傳導物質？
A. 血清張力素（serotonin）
B. 乙醯膽鹼（acetylcholine）
C. 正腎上腺素（norepinephrine）
D. 腎上腺素（epinephrine）

正確答案：C. 正腎上腺素（norepinephrine）